Clinical trial exclusion criterion:
Inability to use the PCA device.

Annotated entities:
- Condition: "Inability"
- Procedure: "use the PCA"